Clinical trial inclusion criterion:
Are between 18 and 70 years of age

Entity relations:
- Has_value("age", "between 18 and 70 years")